腭帆張肌（tensor veli palatini）與下列何肌受相同顱神經支配？
A. 顳肌（temporal muscle）
B. 胸鎖乳突肌（sternocleidomastoid muscle）
C. 二腹肌後腹（posterior belly of digastric muscle）
D. 下直肌（inferior rectus muscle）

正確答案：A. 顳肌（temporal muscle）